Clinical trial inclusion criterion:
Person is walking on average 1km/day.

Annotated entities:
- Observation: "walking"
- Multiplier: "1km/day"